Clinical trial inclusion criterion:
Adult men who have sex with men, and transgender women

Entity relations:
- OR("men who have sex with men", "transgender women")